Patients with galactose intolerance, lapp lactase deficiency or glucose-galactose malabsorption.

The above is a clinical trial exclusion criterion. Annotated with entity spans:
Patients with [Condition: galactose intolerance], [Condition: lapp lactase deficiency] or [Condition: glucose-galactose malabsorption].